Clinical trial inclusion criterion:
Systolic blood pressure> 90 mmHg

Entity relations:
- Has_value("Systolic blood pressure", "> 90 mmHg")